Clinical trial inclusion criterion:
Advanced solid tumor malignancy (during expansion at the maximum tolerated dose, entry will be limited to patients wtih adenocarcinoma of the colon or rectum)

Annotated entities:
- Condition: "Advanced solid tumor malignancy"
- Parsing_Error: "during expansion at the maximum tolerated dose, entry will be limited to patients wtih adenocarcinoma of the colon or rectum"